Clinical trial exclusion criterion:
Currently taking anticoagulants, other than aspirin, unless the patient can be taken off the anticoagulant for surgery.

Annotated entities:
- Drug: "anticoagulants"
- Drug: "aspirin"
- Negation: "other than"
- Non-representable: "unless the patient can be taken off the anticoagulant for surgery"